Clinical trial inclusion criteria:
All patients referred to a participating research centre with suspicion of or confirmed endometrial cancer.
Patients with endometrial or epithelial ovarian cancer who following routine clinical guidelines are offered weekly taxane (paclitaxel) treatment. This will often be a third or fourth line treatment, i.e. patients with advanced disease.
Technical possibility to obtain a new tissue biopsy to determine stathmin level in the tumour recurrence.

Annotated entities:
- Visit: "participating research centre"
- Mood: "suspicion of"
- Qualifier: "confirmed"
- Condition: "endometrial cancer"
- Condition: "epithelial ovarian cancer"
- Condition: "endometrial ovarian cancer"
- Multiplier: "weekly"
- Drug: "taxane"
- Drug: "paclitaxel"
- Procedure: "treatment"
- Non-representable: "This will often be a third or fourth line treatment, i.e. patients with advanced disease."
- Procedure: "tissue biopsy"
- Mood: "Technical possibility to obtain"
- Condition: "tumour recurrence"